下列何種降血糖藥物，最容易發生低血糖的副作用？
A. dipeptidyl peptidase-4（DPP-4）抑制劑
B. sodium-glucose co-transporter 2（SGLT2）抑制劑
C. meglitinide
D. glucagon-like peptide 1（GLP-1）受體促進劑

正確答案：C. meglitinide